Clinical trial exclusion criterion:
CMI > 30

Annotated entities:
- Measurement: "CMI"
- Value: "> 3"